Clinical trial exclusion criterion:
Active positive Hepatitis B, C and HIV serologies

Annotated entities:
- Measurement: "HIV serologies"
- Measurement: "Hepatitis B serologies"
- Measurement: "Hepatitis C serologies"
- Value: "positive"